Clinical trial exclusion criterion:
Presence of a skin lesion suspicious for malignancy, unless excised prior to Day 1.

Entity relations:
- AND("suspicious for malignancy", "malignancy")
- Has_qualifier("skin lesion", "suspicious for malignancy")
- Has_index("prior to Day 1", "Day 1")
- Has_temporal("excised", "prior to Day 1")
- AND("skin lesion", "excised")